Clinical trial exclusion criterion:
Any patient less than 18 years of age

Entity relations:
- Has_value("age", "less than 18 years")